Which is the role of the IFIT1 gene in Systemic Lupus Erythematosus (SLE)?

IFIT1 is a newly discovered systemic lupus erythematosus related up-regulated gene. IFIT1 may interact with Rho/Rac guanine nucleotide exchange factor, and regulate the activation of Rho/Rac proteins.